使用肌肉鬆弛劑拮抗劑膽鹼酶抑制劑（cholinesterase inhibitors），作用在 muscarine 接受器  （muscarinic receptor）所產生的作用，下列何者錯誤？
A. 降低心跳速率（decreased heart rate）
B. 瞳孔縮小（pupillary constriction）
C. 胃腸痙攣（intestinal spasm）
D. 降低膀胱張力（decreased bladder tone）

正確答案：D. 降低膀胱張力（decreased bladder tone）